Clinical trial inclusion criterion:
Non-pregnant (post-menopausal, surgically sterile or using effective contraceptive measures)

Annotated entities:
- Condition: "pregnant"
- Negation: "Non"
- Condition: "surgically sterile"
- Procedure: "surgically"
- Condition: "post-menopausal"
- Procedure: "contraceptive measures"
- Qualifier: "effective"
- Undefined_semantics: "effective"